心臟下緣（inferior border）主要由下列何者形成？
A. 大脈管根部
B. 右心房
C. 左心室
D. 右心室

正確答案：D. 右心室